Which domain of the MOZ/MYST3 protein complex associates with histone H3?

The double PHD finger domain of MOZ/MYST3 induces a-helical structure of the histone H3 tail to facilitate acetylation and methylation sampling and modification.